Clinical trial inclusion criterion:
Idiopathic Parkinson's disease ( Hughes AJ et al. 2001)

Entity relations:
- Has_qualifier("Parkinson's disease", "Idiopathic")